Clinical trial exclusion criterion:
Patients with bleeding disorders including vonWillebrand disease type I.

Annotated entities:
- Condition: "bleeding disorders"
- Condition: "vonWillebrand disease type I"